Clinical trial inclusion criterion:
6. Patients with HIV neuropathy must have had HIV, subjective symptoms of painful peripheral neuropathy, and daily painful symptoms of at least 3 months' duration

Entity relations:
- Has_qualifier("peripheral neuropathy", "painful")
- Has_temporal("painful symptoms", "at least 3 months' duration")
- Has_multiplier("painful symptoms", "daily")
- AND("HIV neuropathy", "HIV")
- AND("HIV neuropathy", "subjective symptoms")
- AND("HIV neuropathy", "peripheral neuropathy")
- AND("HIV neuropathy", "painful symptoms")